Clinical trial exclusion criterion:
A positive pre-study drug/alcohol screen.

Entity relations:
- Has_temporal("drug screen", "pre-study")
- Has_value("drug screen", "positive")
- OR("drug screen", "alcohol screen")